下列有關幽門桿菌（Helicobacter pylori）的敘述，何者錯誤？
A. 是胃炎、胃潰瘍的主要致病因
B. 最適合生長於接近中性的環境中
C. 不具鞭毛，因此沒有運動性
D. 無法生長於大氣環境中

正確答案：C. 不具鞭毛，因此沒有運動性